Clinical trial exclusion criterion:
Any patient with esophageal cancer who is not deemed a surgical candidate or who is not deemed a candidate for the Ivor Lewis technique of esophagectomy (with intrathoracic anastomosis).

Entity relations:
- Has_negation("candidate", "not")
- AND("candidate", "surgical")
- Has_qualifier("esophagectomy", "Ivor Lewis technique")
- AND("candidate", "esophagectomy")
- Has_negation("candidate", "not")
- multi("with intrathoracic anastomosis", "intrathoracic anastomosis")
- Has_qualifier("esophagectomy", "with intrathoracic anastomosis")
- OR("candidate", "candidate")